Betz 細胞（Betz cell）位於大腦皮質的那一層？
A. 錐狀外層（external pyramidal layer）
B. 顆粒內層（internal granular layer）
C. 錐狀內層（internal pyramidal layer）
D. 分子層（molecular layer）

正確答案：C. 錐狀內層（internal pyramidal layer）